Which enzyme is inhibited by Imetelstat?

Imetelstat works by inhibiting telomerase.